Patients with functional dyspepsia that fulfill Rome III criteria with inadequate relief of dyspeptic symptoms

The above is a clinical trial inclusion criterion. Annotated with entity spans:
Patients with [Condition: functional dyspepsia] that fulfill [Qualifier: Rome III criteria] with [Qualifier: inadequate relief] of [Condition: dyspeptic symptoms]